Exclusion criteria controls: First degree relatives with psychiatric disease, Substance abuse during the last 3 month or positive screening of drugs in urine-sample, Head injury with more than 5 minutes of unconsciousness, Components of metal implanted by operation, Pacemaker, Pregnancy, Severe physical illness

The above is a clinical trial exclusion criterion. Annotated with entity spans:
Exclusion criteria [Observation: controls]: [Observation: First degree relatives] with [Condition: psychiatric disease], [Condition: Substance abuse] [Temporal: during the last 3 month] or [Value: positive] [Procedure: screening of drugs] in [Qualifier: urine-sample], [Condition: Head injury] with [Multiplier: more than 5 minutes] of [Condition: unconsciousness], [Device: Components of metal] implanted by operation, [Device: Pacemaker], [Condition: Pregnancy], [Condition: Severe physical illness]